下列關於腎病症候群（nephrotic syndrome, NS）的敘述，何者錯誤？
A. NS 的特點為重度蛋白尿，低白蛋白血症，高血脂症和水腫
B. NS 患者其血漿滲透性降低，可刺激肝臟脂蛋白合成而造成高血脂症，其中以低密度脂蛋白及膽固醇之增加為最常見
C. 有些腎絲球病變，如膜性腎病變（membranous nephropathy）、膜增殖性腎絲球腎炎
D. 高蛋白飲食為治療 NS 的必要方式之一

正確答案：D. 高蛋白飲食為治療 NS 的必要方式之一